Clinical trial inclusion criterion:
Able to comply with the requirements of the protocol and be available for study visits over 52 weeks.

Annotated entities:
- Observation: "Able to comply with the requirements of the protocol"
- Observation: "available for study visits"
- Visit: "study visits"
- Temporal: "over 52 weeks"